一般人處在光亮環境一段時間後，眼睛對光線的敏感度會減低，這種現象稱為光適應（light adaptation），其主要的形成機制與光感細胞（photoreceptor cells）之何種變化有關？
A. 胞內之 cGMP 含量降低
B. 胞內之 rhodopsin 含量降低
C. 細胞之數量減少
D. 細胞膜上之鈉離子通道（sodium channels）不活化

正確答案：B. 胞內之 rhodopsin 含量降低